Clinical trial inclusion criteria:
gestational age between 20 weeks and 23 weeks and 6 days
singleton pregnancies

Annotated entities:
- Measurement: "gestational age"
- Value: "between 20 weeks and 23 weeks and 6 days"
- Condition: "singleton pregnancies"